La carga negativa de un ión carboxilato se puede deslocalizar en los dos oxígenos por resonancia. La electronegatividad de estos átomos de oxígeno contribuye a estabilizar la carga por el llamado:
1. Efecto inductivo sustractor de electrones.
2. Efecto mesómero sustractor de electrones.
3. Efecto inductivo donador de electrones.
4. Efecto hiperconjugativo donador de electrones.

Respuesta correcta: 1. Efecto inductivo sustractor de electrones.